治療子宮內膜異位症的藥物，下列何者最不適合？
A. 黃體素拮抗劑
B. 黃體素
C. 選擇性雌激素接受器調節劑
D. 前列腺素

正確答案：D. 前列腺素